Chronic alcohol abuse

The above is a clinical trial exclusion criterion. Annotated with entity spans:
[Multiplier: Chronic] [Condition: alcohol abuse]